下列關於全面性強直陣攣癲癇發作（generalized tonic-clonic seizures）的敘述，何者錯誤？
A. 一定會造成意識上的喪失
B. 通常不會有前兆（aura）
C. ictal cry（或piercing cry）是導因於呼吸肌與咽喉肌的強直攣縮
D. 發作時因副交感作用的加強會導致血壓上升、心跳急促及瞳孔放大

正確答案：D. 發作時因副交感作用的加強會導致血壓上升、心跳急促及瞳孔放大